Allergy to cis-UCA, or any constituents of the placebo emulsion cream or any constituents of Protopic® ointment

The above is a clinical trial exclusion criterion. Annotated with entity spans:
[Condition: Allergy] to [Drug: cis-UCA], or any constituents of the [Drug: placebo emulsion cream] or any constituents of [Drug: Protopic® ointment]